依據醫療法規定，有關醫療社團法人結餘之分配，下列何者正確？
A. 應提撥百分之十以上作為營運基金
B. 應提撥百分之二十以上作為營運基金
C. 應提撥百分之三以上辦理研發、人才培訓、慈善及其他社會服務
D. 應提撥百分之五以上辦理研發、人才培訓、慈善及其他社會服務

正確答案：B. 應提撥百分之二十以上作為營運基金